18 years old or older.

The above is a clinical trial inclusion criterion. Annotated with entity spans:
[Value: 18 years] [Person: old] or older.